Primigesta de 41 años, en la 38 semana, con diabetes gestacional en tratamiento con dieta de 2200 Kilocalorías e hipertensión arterial esencial. Acude a urgencias por dolor hipogástrico de inicio brusco, con afectación de su estado general, acompañado de una metrorragia escasa de sangre oscura. En la Monitorización      No     Estresante     (MNS) detectamos un patrón de frecuencia cardiaca fetal no reactivo. La principal sospecha diagnóstica será:
1. Descompensación de su diabetes gestacional.
2. Desprendimiento prematuro de la placenta.
3. Preeclampsia grave.
4. Rotura de "vasa previa".
5. Placenta previa.

Respuesta correcta: 2. Desprendimiento prematuro de la placenta.